Clinical trial inclusion criterion:
Degenerative Disc Disease (as defined by neck pain of discogenic origin with degeneration of the disc confirmed by patient history and radiographic studies)

Entity relations:
- Has_qualifier("neck pain", "discogenic origin")
- Has_temporal("degeneration of the disc", "patient history")
- AND("degeneration of the disc", "radiographic studies")
- AND("neck pain", "degeneration of the disc")